at least 13 years old at the time of the procedure

The above is a clinical trial inclusion criterion. Annotated with entity spans:
[Value: at least 13 years] [Person: old] [Temporal: at the time of the procedure]